HCV genotyping 1a, 1b, or mixed 1a/ab. Any non-definitive results will exclude the subject from study participation.

The above is a clinical trial inclusion criterion. Annotated with entity spans:
[Measurement: HCV genotyping] [Value: 1a, 1b, or mixed 1a/ab]. [Non-representable: Any non-definitive results will exclude the subject from study participation.]